Clinical trial exclusion criterion:
Patients who are curable by conventional multidisciplinary management.

Entity relations:
- AND("curable", "conventional multidisciplinary management")